Clinical trial exclusion criterion:
Allergic to contrast

Annotated entities:
- Condition: "Allergic"
- Drug: "contrast"